Clinical trial inclusion criterion:
BCVA of 24 letters or over

Entity relations:
- Has_qualifier("BCVA", "24 letters or over")